Clinical trial exclusion criterion:
Patients with known or suspected right-to-left, bi-directional, or transient right-to-left cardiac shunts

Entity relations:
- Has_mood("right-to-left cardiac shunts", "known")
- OR("right-to-left cardiac shunts", "bi-directional cardiac shunts", "transient right-to-left cardiac shunts")
- OR("known", "suspected")